Clinical trial inclusion criterion:
men and women 30-55 years with BMI 30-40 and waist 95 cm or more

Entity relations:
- Has_value("BMI", "30-40")
- Has_value("waist", "95 cm or more")
- Has_value("30-55 years", "30-55 years")
- multi("30-55 years", "30-55 years")
- OR("men", "women")